Clinical trial exclusion criterion:
Any patient less than 18 years of age

Annotated entities:
- Value: "less than 18 years"
- Person: "age"